Clinical trial exclusion criteria:
Incompletely cured pre-existing diseases for which it can be assumed that the absorption, distribution, metabolism, elimination or effects of the study drugs will not be normal
Known or suspected liver diseases
Clinically relevant findings(e.g. blood pressure, electrocardiogram(ECG); physical and gynecological examination, laboratory examination)

Annotated entities:
- Condition: "pre-existing diseases"
- Qualifier: "Incompletely cured"
- Subjective_judgement: "can be assumed"
- Non-query-able: "Incompletely cured pre-existing diseases for which it can be assumed that the absorption, distribution, metabolism, elimination or effects of the study drugs will not be normal"
- Condition: "liver diseases"
- Qualifier: "suspected"
- Qualifier: "Known"
- Subjective_judgement: "suspected"
- Undefined_semantics: "suspected"
- Measurement: "blood pressure"
- Procedure: "electrocardiogram(ECG)"
- Procedure: "gynecological examination"
- Procedure: "physical examination"
- Procedure: "laboratory examination"
- Qualifier: "Clinically relevant"
- Condition: "findings"
- Subjective_judgement: "Clinically relevant"
- Undefined_semantics: "Clinically relevant"